Galassi classification is used for which disorder?

Galassi classification system is used to classify arachnoid cysts.